Clinical trial inclusion criterion:
Negative urine or serum pregnancy test (for women of childbearing potential) documented within the 24-hour period prior to the first dose of test drug. Additionally, all females must be using reliable contraception during the study and for 3 months after treatment completion

Entity relations:
- Has_value("urine pregnancy test", "Negative")
- AND("women", "urine pregnancy test")
- Has_index("within the 24-hour period prior to the first dose of test drug", "the first dose of test drug")
- Has_temporal("urine pregnancy test", "within the 24-hour period prior to the first dose of test drug")
- AND("women", "childbearing potential")
- OR("urine pregnancy test", "serum pregnancy test")